Possibility to restore a functional occlusion with a minimum of four occlusal units (i.e. pairs of occluding posterior teeth).

The above is a clinical trial inclusion criterion. Annotated with entity spans:
[Post-eligibility: Possibility to restore a functional occlusion with a minimum of four occlusal units (i.e. pairs of occluding posterior teeth)].